Clinical trial inclusion criterion:
Serum or plasma total bilirubin less than or equal to 2.5 times the upper limit of normal

Entity relations:
- Has_qualifier("total bilirubin", "Serum")
- Has_value("total bilirubin", "less than or equal to 2.5 times the upper limit of normal")
- OR("Serum", "plasma")